Clinical trial inclusion criteria:
Subjects must:
1. Be able to give valid informed consent
2. Be 18 55 years of age.
1. Justification: Many neural processes change with age, and these changes could introduce unwanted variability in both behavioral and MRI signals. In addition, the risk of difficult-to-detect medical abnormalities such as silent cerebral infarcts increases with age.
2. Screening tool: History. Government-issued forms of identification (e.g. driver s license, birth certificate) will be required when participant appears to be out of age range.
3. Be in good health.
1. Justification: Many illnesses may alter neural functioning as well as fMRI signals.
2. Screening tools: Medical Assessment, Medical History and Physical Examination. Medical assessments include: Vital Signs, EKG, oral HIV test, height/weight measurements, urinalysis and blood sample. Tests on the blood sample include CBC, complete metabolic profile, TSH, ESR, STS and HIV (if needed to confirm a positive salivary test for HIV). The following individual laboratory results will independently disqualify individuals: Cholesterol >250 mg/dl, Hemoglobin < 10.5 g/dl, WBC < 2400/microl, LFTs > 3Xnormal, HCG positive, Casual serum glucose > 200 mg/dl, Urine protein > 1+. The MAI will retain discretion to exclude at less extreme values, depending on the clinical presentation. (Serum glucose over 140 mg/dl will be followed up with a fasting serum glucose assessment. Those with fasting glucose below 100 mg/dl may be considered for the protocol. Others will be rejected and referred for work-up.) MAI will make the final judgment on any questionable lab results.
4. Right-handed.
1. Justification: Using right-handed individuals will reduce variability in BOLD MRI data.
2. Screening tool: Edinburgh Handedness Inventory.
5. Estimated IQ greater than or equal to 85
1. Justification: Subjects must be able to perform a cognitively challenging task to a high standard.
2. Screening tool: Wechsler Abbreviated Scale of Intelligence.

Annotated entities:
- Parsing_Error: "Subjects must:"
- Parsing_Error: "1."
- Non-query-able: "Be able to give valid informed consent"
- Post-eligibility: "Be able to give valid informed consent"
- Parsing_Error: "2."
- Person: "age"
- Value: "18 55 years"
- Parsing_Error: "1."
- Parsing_Error: "Justification: Many neural processes change with age, and these changes could introduce unwanted variability in both behavioral and MRI signals."
- Not_a_criteria: "Justification: Many neural processes change with age, and these changes could introduce unwanted variability in both behavioral and MRI signals."
- Not_a_criteria: "In addition, the risk of difficult-to-detect medical abnormalities such as silent cerebral infarcts increases with age."
- Parsing_Error: "In addition, the risk of difficult-to-detect medical abnormalities such as silent cerebral infarcts increases with age."
- Parsing_Error: "2."
- Temporal: "History"
- Not_a_criteria: "Government-issued forms of identification (e.g. driver s license, birth certificate) will be required when participant appears to be out of age range."
- Parsing_Error: "3."
- Condition: "good health"
- Undefined_semantics: "good health"
- Subjective_judgement: "good health"
- Parsing_Error: "1."
- Not_a_criteria: "Justification: Many illnesses may alter neural functioning as well as fMRI signals."
- Parsing_Error: "2."
- Procedure: "Medical Assessment"
- Temporal: "Medical History"
- Procedure: "Physical Examination"
- Measurement: "Vital Signs"
- Procedure: "EKG"
- Procedure: "oral HIV test"
- Measurement: "height measurement"
- Measurement: "weight measurement"
- Procedure: "urinalysis"
- Procedure: "blood sample"
- Procedure: "CBC"
- Procedure: "complete metabolic profile"
- Procedure: "TSH"
- Procedure: "ESR"
- Procedure: "STS"
- Procedure: "HIV"
- Measurement: "salivary test for HIV"
- Value: "positive"
- Grammar_Error: "disqualify"
- Measurement: "Cholesterol"
- Value: ">250 mg/dl"
- Measurement: "Hemoglobin"
- Value: "< 10.5 g/dl"
- Measurement: "WBC"
- Value: "< 2400/microl"
- Measurement: "LFTs"
- Value: "> 3Xnormal"
- Measurement: "HCG"
- Value: "positive"
- Measurement: "serum glucose"
- Value: "> 200 mg/dl"
- Measurement: "Urine protein"
- Value: "> 1+"
- Negation: "disqualify"
- Not_a_criteria: "The MAI will retain discretion to exclude at less extreme values, depending on the clinical presentation."
- Subjective_judgement: "The MAI will retain discretion to exclude at less extreme values, depending on the clinical presentation."
- Measurement: "Serum glucose"
- Value: "over 140 mg/dl"
- Procedure: "fasting serum glucose assessment"
- Parsing_Error: "4."
- Condition: "Right-handed"
- Parsing_Error: "1."
- Not_a_criteria: "Justification: Using right-handed individuals will reduce variability in BOLD MRI data."
- Parsing_Error: "2."
- Not_a_criteria: "Screening tool: Edinburgh Handedness Inventory."
- Procedure: "Edinburgh Handedness Inventory"
- Parsing_Error: "5."
- Measurement: "Estimated IQ"
- Value: "greater than or equal to 85"
- Parsing_Error: "1."
- Not_a_criteria: "Justification: Subjects must be able to perform a cognitively challenging task to a high standard."
- Parsing_Error: "2."
- Procedure: "Wechsler Abbreviated Scale of Intelligence"